Patients with moderate to severe hepatic encephalopathy.

The above is a clinical trial exclusion criterion. Annotated with entity spans:
Patients with [Qualifier: moderate] to [Qualifier: severe] [Condition: hepatic encephalopathy].